8. Life expectancy <1 yr.;

The above is a clinical trial exclusion criterion. Annotated with entity spans:
[Parsing_Error: 8.] [Observation: Life expectancy] [Value: <1 yr].;